Clinical trial exclusion criteria:
Psoriasis or psoriasis arthropathy
Inflammatory bowel disease
Unwillingness to participate in the study with additional imaging protocols
Expected life-span less than <1 year
Diabetes (to improve the PET imaging quality)
Probable noncompliance
Pregnancy
Age <18 years or >75 years
Contraindication for adalimumab
Methotrexate used within the previous 6 months
A biologic medicine used within the previous 6 months

Annotated entities:
- Condition: "Psoriasis"
- Condition: "psoriasis arthropathy"
- Condition: "Inflammatory bowel disease"
- Informed_consent: "Unwillingness to participate in the study with additional imaging protocols"
- Observation: "Expected life-span"
- Value: "less than <1 year"
- Condition: "Diabetes"
- Procedure: "PET imaging quality"
- Qualifier: "Probable"
- Condition: "noncompliance"
- Condition: "Pregnancy"
- Person: "Age"
- Value: "<18 years"
- Value: ">75 years"
- Condition: "Contraindication"
- Drug: "adalimumab"
- Drug: "Methotrexate"
- Temporal: "within the previous 6 months"
- Drug: "biologic medicine"
- Temporal: "within the previous 6 months"